下列何種神經皮膚症候群（neurocutaneous syndrome）之遺傳模式為偶發型（sporadic）？
A. Neurofibromatosis I（NF-I）
B. Tuberous sclerosis
C. Sturge-Weber syndrome
D. Von Hippel-Lindau disease

正確答案：C. Sturge-Weber syndrome